Elective surgery for thoracic aneurysm

The above is a clinical trial inclusion criterion. Annotated with entity spans:
[Procedure: Elective surgery] for [Condition: thoracic aneurysm]